Clinical trial exclusion criteria:
younger than 18 years old
HBsAg positive or HBcAb negative or hepatitis B virus DNA positive at baseline
pregnant or lactating women

Annotated entities:
- Value: "younger than 18 years"
- Person: "old"
- Condition: "HBsAg positive"
- Condition: "HBcAb negative"
- Condition: "hepatitis B virus DNA positive"
- Temporal: "at baseline"
- Condition: "pregnant"
- Condition: "lactating"
- Person: "women"